Clinical trial exclusion criterion:
Treatment with bupropion, varenicline, or nicotine replacement products in the month prior to study inclusion

Annotated entities:
- Drug: "bupropion"
- Drug: "varenicline"
- Drug: "nicotine replacement products"
- Temporal: "in the month prior to study inclusion"
- Reference_point: "study inclusion"
- Procedure: "Treatment"